Clinical trial inclusion criteria:
Has a cataract and is expected to undergo clear corneal cataract surgery with phacoemulsification and implantation of a posterior chamber intraocular lens
Has a potential post-operative pinhole corrected Snellen VA of at least 20/200 or better in both eyes

Annotated entities:
- Condition: "cataract"
- Procedure: "clear corneal cataract surgery"
- Qualifier: "with phacoemulsification"
- Qualifier: "implantation of a posterior chamber intraocular lens"
- Measurement: "pinhole corrected Snellen VA"
- Value: "at least 20/200 or better"
- Qualifier: "both eyes"